Clinical trial inclusion criterion:
Minimal use of chlorhexidine bathing*

Entity relations:
- multi("chlorhexidine bathing", "chlorhexidine")
- Has_multiplier("chlorhexidine bathing", "Minimal use")